Clinical trial exclusion criteria:
Taking other drugs which can influence the lipid profile (eg. Niacin, Fibrates;
Serum creatinine level > 2.0 mg/dL
Serum aspartate transaminase > 3 times upper limit of normal
Serum alanine transaminase > 3 times upper limit of normal
Having anaphylactic reaction for Rosuvastatin;
Having the other contraindications for Rosuvastatin;
Having plan to be pregnant;
Having life expectancy less than 1 year

Annotated entities:
- Qualifier: "other"
- Drug: "drugs"
- Qualifier: "can influence the lipid profile"
- Measurement: "lipid profile"
- Drug: "Niacin"
- Drug: "Fibrates"
- Measurement: "Serum creatinine level"
- Value: "> 2.0 mg/dL"
- Measurement: "Serum aspartate transaminase"
- Value: "> 3 times upper limit of normal"
- Measurement: "Serum alanine transaminase"
- Value: "> 3 times upper limit of normal"
- Condition: "anaphylactic reaction"
- Drug: "Rosuvastatin"
- Condition: "contraindications"
- Drug: "Rosuvastatin"
- Mood: "plan"
- Condition: "pregnant"
- Observation: "life expectancy"
- Value: "less than 1 year"